Alanine transaminase (ALT) less than 3 x ULN

The above is a clinical trial inclusion criterion. Annotated with entity spans:
[Measurement: Alanine transaminase (ALT)] [Value: less than 3 x ULN]